Clinical trial exclusion criterion:
pregnancy

Annotated entities:
- Condition: "pregnancy"